Clinical trial exclusion criterion:
Patients participate in other clinical studies;

Annotated entities:
- Competing_trial: "Patients participate in other clinical studies"